正常足月產婦分娩時，診斷為延長潛伏期障礙（prolonged latent phase）之最優先處置為何？
A. 剖腹產
B. 休息觀察
C. 增加腹壓，促進胎兒下降
D. 高位產鉗生產

正確答案：B. 休息觀察